結腸帶（teniae coli）由下列何種構造形成？
A. 黏膜肌層（muscularis mucosa）內的平滑肌
B. 黏膜肌層（muscularis mucosa）內的骨骼肌
C. 外肌層（muscularis externa）的內環平滑肌
D. 外肌層（muscularis externa）的外縱平滑肌

正確答案：D. 外肌層（muscularis externa）的外縱平滑肌